HbA1c (accordingly to IFCC) 47 mmol/mol - 110 mmol/mol.

The above is a clinical trial inclusion criterion. Annotated with entity spans:
[Measurement: HbA1c] (accordingly to IFCC) [Value: 47 mmol/mol - 110 mmol/mol].